Clinical trial exclusion criterion:
DPP4 inhibitors or Sodium-glucose cotransporter-2(SGLT2) inhibitors within the previous 4 weeks

Entity relations:
- Has_temporal("DPP4 inhibitors", "within the previous 4 weeks")
- OR("DPP4 inhibitors", "Sodium-glucose cotransporter-2(SGLT2) inhibitors")